Clinical trial inclusion criterion:
No allergies to any test foods

Annotated entities:
- Condition: "allergies"
- Negation: "No"
- Observation: "test foods"